Clinical trial inclusion criteria:
ASA I and II women
18-45 yrs old
Singleton pregnancy
Cervical cerclage 1st or 2nd trimester of pregnancy undergoing with spinal anesthesia
Height 150 - 180 cm
BMI = 40 kg/m2.

Annotated entities:
- Measurement: "ASA"
- Value: "I and II"
- Person: "women"
- Person: "old"
- Value: "18-45 yrs"
- Condition: "Singleton pregnancy"
- Procedure: "Cervical cerclage"
- Qualifier: "1st trimester"
- Qualifier: "2nd trimester"
- Condition: "pregnancy"
- Procedure: "spinal anesthesia"
- Measurement: "Height"
- Value: "150 - 180 cm"
- Measurement: "BMI"
- Value: "= 40 kg/m2"